下列何者少見於鴉片類物質過量（opioid overdose）？
A. 瞳孔縮小
B. 反應變差（unresponsiveness）
C. 呼吸抑制（respiratory depression）
D. 體溫升高

正確答案：D. 體溫升高